Clinical trial exclusion criteria:
Contraindications for magnetic resonance imaging
Hemosiderosis/hemochromatosis ( patients can still be included in the non-ferumoxytol arm)

Annotated entities:
- Condition: "Contraindications"
- Procedure: "magnetic resonance imaging"
- Condition: "Hemosiderosis"
- Condition: "hemochromatosis"